What bacteria is associated with Gastric cancer and peptic ulcers?

Peptic ulcer and gastric cancer are caused by the same bacteria, Helicobacter pylori.